Men and women patients, with age ranging 40-80.

The above is a clinical trial inclusion criterion. Annotated with entity spans:
[Person: Men] and [Person: women] patients, with [Person: age] [Value: ranging 40-80].